Según los estudios de resultado, cuando se está aplicando la técnica de Exposición hay que tener en cuenta que le exposición masiva y prolongada produce:
1. Peores resultados inmediatos que la exposición espaciada.
2. Mejores resultado inmediatos que la exposición espaciada.
3. No hay diferencias de resultados en cuanto al tipo de exposición.
4. Peores resultados inmediatos si se realiza en más de un día.
5. Mejores resultados inmediatos solamente en pacientes con depresión.

Respuesta correcta: 2. Mejores resultado inmediatos que la exposición espaciada.